常見工業用甲醇中毒（methanol intoxication）時，可以靜脈注射下列何者來延緩甲醇的毒性代謝產物產生？
A. 甲酸（formic acid）
B. 乙烯乙二醇（ethylene glycol）
C. 乙醇（ethanol）
D. 異丙醇（isopropanol）

正確答案：C. 乙醇（ethanol）